Clinical trial exclusion criterion:
Contraindications for MRI, including, but not limited to pacemaker, aneurysm clips, neurostimulators, cochlear implants, metal in eyes, steel worker, intra-uterine devices for birth control.

Entity relations:
- Has_qualifier("metal", "eyes")
- Has_negation("pacemaker", "not")
- AND("Contraindications", "MRI")
- OR("pacemaker", "aneurysm clips", "neurostimulators", "cochlear implants", "metal", "steel worker", "intra-uterine devices")